有關慢性阻塞性肺病（chronic obstructive pulmonary disease）之敘述，下列何者錯誤？
A. 主要造成因素包括抽菸、空氣污染或基因缺陷所導致
B. 發炎細胞主要為嗜中性白血球（neutrophils）及巨噬細胞（macrophages），並無T lymphocytes或eosinophils
C. 臨床症狀及肺功能表現與慢性氣喘有時不易區分
D. 臨床治療以支氣管擴張劑為主，部分特定病患也可以使用吸入型類固醇

正確答案：B. 發炎細胞主要為嗜中性白血球（neutrophils）及巨噬細胞（macrophages），並無T lymphocytes或eosinophils